Clinical trial exclusion criterion:
surgical interventions for PD;

Entity relations:
- AND("surgical interventions for PD", "PD")